可用於治療肺高壓（pulmonary hypertension）藥物的作用機轉，不包括下列何者？
A. endothelin antagonist
B. phosphodiesterase E5 inhibitor
C. soluble guanylyl cyclase activator
D. calcitonin gene-related peptide（CGRP）antagonist

正確答案：D. calcitonin gene-related peptide（CGRP）antagonist